下列何者非肝癌之危險因子？
A. 肝硬化（liver cirrhosis）
B. 酗酒（alcoholism）
C. 抽菸（smoking）
D. 遲發性皮膚紫質症（porphyria cutaneous tarda）

正確答案：C. 抽菸（smoking）